Current use of active topical medication in the planned investigational area for chronic atopic dermatitis within two weeks

The above is a clinical trial exclusion criterion. Annotated with entity spans:
Current use of [Temporal: active] [Drug: topical medication] in the planned investigational area for [Condition: chronic atopic dermatitis] [Temporal: within two weeks]